El líquido sinovial de pacientes afectos de gota a menudo contiene:
1. Cristales de ácido hipúrico.
2. Cristales de tirosina.
3. Cristales de fosfato triple.
4. Cristales de urato.
5. Cristales de oxalato cálcico.

Respuesta correcta: 4. Cristales de urato.